Known risk factors for, or presence of, a cardiovascular disease

The above is a clinical trial exclusion criterion. Annotated with entity spans:
Known [Observation: risk factors] for, or presence of, a [Condition: cardiovascular disease]